Clinical trial exclusion criterion:
Chronic pain syndrome defined as use of any analgesic medication on a daily or near-daily basis

Entity relations:
- Has_qualifier("analgesic medication", "any")
- Has_multiplier("analgesic medication", "on a near-daily basis")
- Subsumes("Chronic pain syndrome", "analgesic medication")
- OR("on a near-daily basis", "on a daily basis")